Evidence of blood dyscrasia

The above is a clinical trial exclusion criterion. Annotated with entity spans:
[Mood: Evidence] of [Condition: blood dyscrasia]